關於致病菌與疾病的配對，下列何者錯誤？
A. 肺炎克雷白氏桿菌（Klebsiella pneumoniae）- 肝膿瘍（liver abscess）
B. 創傷弧菌（Vibrio vulnificus）- 	血症（septicemia）
C. 空腸彎曲桿菌（Campylobacter jejuni）- 腸胃炎（gastroenteritis）
D. 鼠疫桿菌（Yersinia pestis）-萊姆病（Lyme disease）

正確答案：D. 鼠疫桿菌（Yersinia pestis）-萊姆病（Lyme disease）